Clinical trial exclusion criteria:
Non papillary gross features of the tumor
Anteriorly located tumor
Patients criteria
Poor performance status
History of BCG sepsis
History of bladder irradiation
Contracted bladder

Annotated entities:
- Condition: "Non papillary gross features"
- Condition: "tumor"
- Qualifier: "Anteriorly located"
- Condition: "tumor"
- Non-representable: "Patients criteria"
- Observation: "performance status"
- Value: "Poor"
- Condition: "BCG"
- Condition: "sepsis"
- Temporal: "History"
- Condition: "bladder irradiation"
- Temporal: "History"
- Condition: "Contracted bladder"